Clinical trial exclusion criterion:
Treatment with levothyroxine must not be initiated in patients with acute myocardial infarction, acute myocarditis, or acute pancarditis.

Entity relations:
- AND("Treatment", "levothyroxine")
- Has_negation("Treatment", "not be initiated")
- AND("acute myocardial infarction", "Treatment")
- OR("acute myocardial infarction", "acute myocarditis", "acute pancarditis")